對於神經性梅毒（neurosyphilis）的敘述，下列何者正確？
A. 若測得病患血中的VDRL（Veneral Disease Research Laboratory）效價增高，即可用來確診神經性梅毒感
B. 病患的脊髓液需要做螢光螺旋體抗體試驗（fluorescent treponemal antibody absorption test, FTA-ABS）。
C. 病患可以出現Argyll-Robertson瞳孔，其症狀是光反射消失，兩眼往內往近看時，瞳孔的收縮反射消失
D. 可以導致tabes dorsalis病徵，病患出現類似刀割的神經痛、進行性的共濟失調及本體感覺缺失

正確答案：D. 可以導致tabes dorsalis病徵，病患出現類似刀割的神經痛、進行性的共濟失調及本體感覺缺失